Clinical trial inclusion criterion:
Renal function: serum creatinine is 44-133 mmol/L;

Annotated entities:
- Measurement: "serum creatinine"
- Value: "44-133 mmol/L"